Partial hepatectomy

The above is a clinical trial inclusion criterion. Annotated with entity spans:
[Procedure: Partial hepatectomy]